Patient who is HbsAg negative has received an HbsAg positive (HBV DNA by PCR or HBV antibody) donor liver

The above is a clinical trial exclusion criterion. Annotated with entity spans:
Patient who is [Measurement: HbsAg] [Value: negative] has received an [Measurement: HbsAg] [Value: positive] ([Measurement: HBV DNA] by [Measurement: PCR] or [Measurement: HBV antibody]) [Person: donor] [Qualifier: liver]